Which is the target of belimumab in Systemic Lupus Erythematosus treatment?

Belimumab: a BLyS-specific inhibitor for systemic lupus erythematosus To review the efficacy, safety, dosing, drug interactions, as well as economic and therapeutic considerations of belimumab, an inv